Clinical trial inclusion criterion:
Chronic pain for at least 3 months prior to inclusion, measured by VAS. (VAS 4 or above);

Entity relations:
- Has_index("at least 3 months prior", "inclusion")
- Has_temporal("Chronic pain", "at least 3 months prior")
- Has_qualifier("Chronic pain", "measured by VAS")
- Has_value("VAS", "4 or above")